Confiere a la membrana plasmática alta permeabilidad al agua:
1. Acuaporinas.
2. Canales iónicos.
3. La Na+/K+-ATPasa.
4. Intercambiador Cl/HCO3.
5. Su composición lípidica.

Respuesta correcta: 1. Acuaporinas.